Clinical trial exclusion criterion:
The receipt of any investigational product within 3 months prior to this trial

Annotated entities:
- Drug: "investigational product"
- Temporal: "within 3 months prior to this trial"
- Reference_point: "this trial"